Clinical trial inclusion criterion:
Remains hospitalized after birth (has never been discharged home)

Annotated entities:
- Observation: "hospitalized"
- Temporal: "after birth"
- Reference_point: "birth"